Patients who received corticosteroids in the last 6 weeks.

The above is a clinical trial exclusion criterion. Annotated with entity spans:
Patients who received [Drug: corticosteroids] [Temporal: in the last 6 weeks].